What is the difference between Daptacel and Pentacel?

Pentacel is a combination vaccine equivalent to the combination of Daptacel, IPOL and ActHIB vaccines.